Pregnant or nursing women, or females with a positive pregnancy test at screening

The above is a clinical trial exclusion criterion. Annotated with entity spans:
[Condition: Pregnant] or [Condition: nursing] [Person: women], or [Person: females] with a [Value: positive] [Measurement: pregnancy test] [Temporal: at screening]